Clinical trial exclusion criteria:
Patients with a calculated PRA higher than 0% per solid phase and / or anti-HLA class I and / or class II antibodies detectable by single antigen test (Luminex®).
Positive result of Cross Match.
Patients who receive a graft from a cadaver donor.
Identical HLA patients
Patients who have undergone a previous solid organ transplant (including kidney transplant) or who are going to receive another solid organ transplant concomitantly.
Glomerular primary focal and segmental sclerosis
Atypical hemolytic uremic syndrome (aHUS) / thrombotic thrombocytopenic purpura syndrome.
Patients with chronic infection with Hepatitis B virus (HBV) and / or active infection with Hepatitis C virus (positive PCR result) at the time of transplant.
Patients with infection with the known Human Immunodeficiency Virus (HIV).
Patients with active systemic infection that requires the continued administration of antibiotics.
Patients with any neoplasm except localized skin cancer and who is receiving adequate treatment.
Patients with severe anemia (hemoglobin <6g / dl), leukopenia (WBC <2500 / mm3) and / or thrombocytopenia (platelets <80,000 / mm3).
Patients who are hemodynamically unstable even if they have hemoglobin levels> 6g / dL.
Patients with intestinal pathology or severe diarrhea that may decrease absorption according to medical criteria.
Patients with known hypersensitivity to any of the drugs used in this study.
Patients who have received any investigational drug in the 30 days prior to their inclusion in this study.
Potentially fertile women who do not agree to use reliable contraceptive measures during the trial, who are pregnant, breastfeeding or who present a positive pregnancy test at the time of their inclusion in the study.
Patients who are legally detained in an official institution.

Annotated entities:
- Measurement: "calculated PRA"
- Value: "higher than 0% per solid phase"
- Procedure: "single antigen test"
- Value: "anti-HLA class I"
- Value: "anti-HLA class II"
- Procedure: "Luminex"
- Procedure: "Cross Match"
- Value: "Positive"
- Procedure: "graft from a cadaver donor"
- Condition: "Identical HLA"
- Procedure: "solid organ transplant"
- Temporal: "previous"
- Procedure: "kidney transplant"
- Qualifier: "another"
- Procedure: "solid organ transplant"
- Temporal: "concomitantly"
- Condition: "Glomerular primary focal sclerosis"
- Condition: "Glomerular segmental sclerosis"
- Condition: "Atypical hemolytic uremic syndrome (aHUS)"
- Condition: "thrombotic thrombocytopenic purpura syndrome"
- Condition: "Hepatitis B virus (HBV)"
- Condition: "Hepatitis C virus"
- Procedure: "PCR result"
- Value: "positive"
- Qualifier: "chronic"
- Qualifier: "active"
- Temporal: "at the time of transplant"
- Condition: "Human Immunodeficiency Virus (HIV)"
- Condition: "systemic infection"
- Qualifier: "active"
- Drug: "antibiotics"
- Multiplier: "continued administration"
- Condition: "neoplasm"
- Negation: "except"
- Condition: "localized skin cancer"
- Qualifier: "severe"
- Condition: "anemia"
- Measurement: "hemoglobin"
- Value: "<6g / dl"
- Condition: "leukopenia"
- Measurement: "WBC"
- Value: "<2500 / mm3"
- Condition: "thrombocytopenia"
- Measurement: "platelets"
- Value: "<80,000 / mm3"
- Condition: "hemodynamically unstable"
- Measurement: "hemoglobin levels"
- Value: "> 6g / dL"
- Condition: "intestinal pathology"
- Condition: "severe diarrhea"
- Observation: "may decrease absorption"
- Condition: "hypersensitivity"
- Drug: "drugs used in this study"
- Competing_trial: "Patients who have received any investigational drug in the 30 days prior to their inclusion in this study."
- Pregnancy_considerations: "Potentially fertile women who do not agree to use reliable contraceptive measures during the trial, who are pregnant, breastfeeding or who present a positive pregnancy test at the time of their inclusion in the study."
- Observation: "legally detained"
- Visit: "official institution"